History of a primary sleep disorder other than RLS that may significantly affect the symptoms of RLS.

The above is a clinical trial exclusion criterion. Annotated with entity spans:
History of a [Condition: primary sleep disorder] [Negation: other] than [Condition: RLS] that may significantly affect the symptoms of RLS.